Clinical trial exclusion criterion:
pelvic inflammatory disease

Annotated entities:
- Condition: "pelvic inflammatory disease"